¿Qué es la alodinia?:
1. Sensación dolorosa desencadenada por estímulos no dolorosos.
2. Sensación anormal, pero no dolorosa.
3. Sensación en la que el paciente presenta un elevado umbral de estimulación.
4. Sensación de hormigueo o adormecimiento.
5. Sensación dolorosa incrementada frente a un estímulo doloroso.

Respuesta correcta: 1. Sensación dolorosa desencadenada por estímulos no dolorosos.